Parents refusal

The above is a clinical trial exclusion criterion. Annotated with entity spans:
[Observation: Parents refusal]